Clinically significant agitation /aggression for which either 1) the frequency of agitation /aggression as assessed by the NPI is 'Very frequently', or 2) the frequency of agitation /aggression as assessed by the NPI is 'Frequently' AND the severity of the agitation as assessed by the NPI is 'Moderate', or 'Marked'

The above is a clinical trial exclusion criterion. Annotated with entity spans:
[Qualifier: Clinically significant] [Condition: agitation /aggression] for which either 1) the [Multiplier: frequency of agitation /aggression] as assessed by the [Measurement: NPI] is '[Value: Very frequently]', or 2) the [Multiplier: frequency of agitation /aggression] as assessed by the [Measurement: NPI] is '[Value: Frequently]' AND the [Qualifier: severity of the agitation] as assessed by the [Measurement: NPI] is '[Value: Moderate]', or '[Value: Marked]'